Clinical trial inclusion criterion:
-Patients residing in the following clinical states wit! be considered: A. Rising PSA: Patients with a history of localized disease who have undergone definitive radiation or surgery. These patients must demonstrate progression of disease biochemically as outlined below. Patients in this group may not have radiographically evident disease.

Annotated entities:
- Parsing_Error: "-Patients residing in the following clinical states wit!"
- Parsing_Error: "be considered: A."
- Measurement: "PSA"
- Value: "Rising"
- Temporal: "history of"
- Condition: "localized disease"
- Procedure: "radiation"
- Procedure: "surgery"
- Qualifier: "definitive"
- Observation: "progression of disease"
- Qualifier: "biochemically"
- Qualifier: "radiographically evident"
- Condition: "disease"